Durante su jornada laboral en la Unidad de Cirugía, usted recibe a un paciente intervenido quirúrgicamente procedente de la Unidad de Recuperación Post-Anestésica. Al valorarlo observa que porta un drenaje de Penrose. ¿Cuál de las siguientes afirmaciones sobre este tipo de drenaje es la correcta?
1. Es un drenaje activo que actúa por gravedad.
2. Debe ser conectado a una bolsa recolectora de circuito cerrado.
3. Funciona por aspiración.
4. Es un drenaje pasivo cuyo mecanismo de acción es por capilaridad.
5. Se coloca en las vías biliares.

Respuesta correcta: 4. Es un drenaje pasivo cuyo mecanismo de acción es por capilaridad.